Serious adverse reaction to any vaccination, as respiratory difficulty, angioedema and anaphylaxis;

The above is a clinical trial exclusion criterion. Annotated with entity spans:
Serious [Condition: adverse reaction] to any [Procedure: vaccination], as [Condition: respiratory difficulty], [Condition: angioedema] and [Condition: anaphylaxis];